Clinical trial inclusion criterion:
Patients with PN during their hospitalization

Annotated entities:
- Procedure: "PN"
- Temporal: "during their hospitalization"
- Reference_point: "their hospitalization"
- Procedure: "hospitalization"